Clinical trial exclusion criterion:
History of, or clinical evidence of, a condition which, in the opinion of the investigator, could confound the results of the study or put the subject at undue risk

Annotated entities:
- Temporal: "History"
- Observation: "clinical evidence"
- Condition: "could confound the results of the study or put the subject at undue risk a condition which"